關於產志賀毒素大腸桿菌（Shiga toxin-producing Escherichia coli）的敘述，下列何者錯誤？
A. 會導致經由食物傳播（food-borne）的疾病
B. 常引起人類嚴重感染症的血清型為O157:H7
C. 疾病嚴重時可能會引起血性腹瀉（bloody diarrhea）
D. 不產生stx1或stx2毒素

正確答案：D. 不產生stx1或stx2毒素